Clinical trial exclusion criterion:
Treatment with antineoplastic or immunosuppressive drugs within 8 weeks prior to study inclusion

Entity relations:
- Has_index("within 8 weeks prior to study inclusion", "study inclusion")
- AND("Treatment", "antineoplastic drugs")
- OR("antineoplastic drugs", "immunosuppressive drugs")
- OR("Treatment", "within 8 weeks prior to study inclusion")